左側L5～S1腰椎間盤突出，突出位置偏中間，壓到的脊神經是：
A. L4
B. L5及S1
C. S1
D. Co1

正確答案：C. S1